周邊神經因創傷而橫斷所發生的變化，下列敘述何者正確？
A. 軸索（axon）被破壞，髓鞘一般仍維持完好
B. 橫斷近端（近神經細胞體）之神經纖維發生華勒氏變性（Wallerian degeneration）
C. 創傷性神經瘤（traumatic neuroma）是因神經再生而形成，它的成分是軸索，但不含其他支持細胞如許旺氏細胞（Schwann cell），纖維組織母細胞（fibroblasts）等
D. 被切斷的神經之近端退化，一般只影響2-3結間節的距離

正確答案：D. 被切斷的神經之近端退化，一般只影響2-3結間節的距離